Clinical trial inclusion criteria:
Able to give informed consent
Right-handed
Age between 18-50 years old,
Physically and neurologically healthy [confirmed by a comprehensive medical history]
Current PTSD diagnosis

Annotated entities:
- Post-eligibility: "Able to give informed consent"
- Condition: "Right-handed"
- Person: "Age"
- Value: "between 18-50 years old"
- Condition: "neurologically healthy"
- Condition: "healthy Physically"
- Procedure: "comprehensive medical history"
- Condition: "PTSD"
- Temporal: "Current"